Subject had any previous left atrial ablation.

The above is a clinical trial exclusion criterion. Annotated with entity spans:
Subject had any previous [Qualifier: left] [Procedure: atrial ablation].